Chronic kidney disease in stages = 4, as defined per National Kidney Foundation (8).

The above is a clinical trial exclusion criterion. Annotated with entity spans:
[Condition: Chronic kidney disease] in [Measurement: stages] [Value: = 4], as defined per [Qualifier: National Kidney Foundation] (8).